Able to read and write in English

The above is a clinical trial inclusion criterion. Annotated with entity spans:
[Observation: Able to read and write in English]